Patients with brain metastases or any history of brain metastases

The above is a clinical trial exclusion criterion. Annotated with entity spans:
Patients with [Condition: brain metastases] or any [Temporal: history] of [Condition: brain metastases]